En el proceso de maduración de la afinidad de los linfocitos B en los centros germinales intervienen como células accesorias:
1. Macrófagos.
2. Linfocitos Th1.
3. Mastocitos.
4. Células dendríticas foliculares.
5. Células de Langerhans.

Respuesta correcta: 4. Células dendríticas foliculares.